Clinical trial exclusion criterion:
30 min or more of moderate to vigorous activity more than 3 times per week

Entity relations:
- Has_multiplier("moderate to vigorous activity", "30 min or more")
- Has_multiplier("moderate to vigorous activity", "more than 3 times per week")